Clinical trial exclusion criterion:
Physical impossibility for apply the drug

Annotated entities:
- Non-representable: "Physical impossibility for apply the drug"